El sistema gastrointestinal libera una hormona peptídica que aumenta durante el ayuno y disminuye tras la ingesta, denominada:
1. Leptina.
2. Colecistoquinina.
3. Grelina.
4. Insulina.
5. Glucógeno.

Respuesta correcta: 3. Grelina.